下列何種藥物可以有效地預防病人感染 Onchocerca volvulus 引發蟠尾絲蟲病（onchocerciasis）而造成"river blindness＂？
A. Diethylcarbamazine
B. Bithionol
C. Oxamniquine
D. Ivermectin

正確答案：D. Ivermectin